80 歲糖尿病女性患者抱怨最近半年來常有不自覺尿失禁的情形，患者描述每次排尿量均不多，且每小時可能要上廁所 1~2 次，身體檢查發現小腹微脹，但患者沒有尿脹的感覺。請問患者的尿失禁最可能是下列何種？
A. 滿脹型尿失禁（overflow incontinence）
B. 急尿型尿失禁（urge incontinence）
C. 應力型尿失禁（stress incontinence）
D. 真性尿失禁（true incontinence）

正確答案：A. 滿脹型尿失禁（overflow incontinence）